胸管經由下列何者穿過橫膈進入胸腔？
A. 食道裂孔
B. 主動脈裂孔
C. 下腔靜脈裂孔
D. 外側弓狀韌帶

正確答案：B. 主動脈裂孔